Clinical trial exclusion criterion:
Participation to other studies

Annotated entities:
- Competing_trial: "Participation to other studies"